Patients with the risk factors for bowel obstruction or bowel perforation (examples include but not limited to a history of acute diverticulitis, intra-abdominal abscess, abdominal carcinomatosis).

The above is a clinical trial exclusion criterion. Annotated with entity spans:
Patients with the [Condition: risk factors for bowel obstruction] or [Condition: bowel perforation] (examples include but not limited to a [Temporal: history] of [Condition: acute diverticulitis], [Condition: intra-abdominal abscess], [Condition: abdominal carcinomatosis]).